下列何者不是中風病人步行訓練使用足踝裝具（ankle-foot orthosis）最主要的目的？
A. 提供足弓（plantar arch）著地的穩定性
B. 增加踝關節背屈（dorsiflexion）肌力
C. 矯正蹠屈攣縮（plantar flexion contracture）
D. 防止足部下垂（drop foot）

正確答案：A. 提供足弓（plantar arch）著地的穩定性